active infection

The above is a clinical trial exclusion criterion. Annotated with entity spans:
[Condition: active infection]